Clinical trial exclusion criterion:
positive drug screen at the time of delivery

Annotated entities:
- Measurement: "drug screen"
- Value: "positive"
- Temporal: "at the time of delivery"
- Reference_point: "the time of delivery"
- Procedure: "delivery"